Clinical trial inclusion criterion:
Subject has a bone stock compromised by disease, infection or prior implantation which cannot provide adequate support and/or fixation to the devices.

Entity relations:
- AND("adequate support", "cannot")
- Has_temporal("implantation", "prior")
- Has_context("implantation", "adequate support")
- AND("bone stock compromised", "disease")
- OR("adequate support", "fixation to the devices")
- OR("disease", "implantation", "infection")